膽囊動脈（cystic artery）通常來自於：
A. common hepatic artery
B. right hepatic artery
C. left hepatic artery
D. supraduodenal artery

正確答案：B. right hepatic artery